Known macrovascular disease including coronary artery disease, stroke/TIA or peripheral vascular disease

The above is a clinical trial exclusion criterion. Annotated with entity spans:
Known [Condition: macrovascular disease] including [Condition: coronary artery disease], [Condition: stroke]/[Condition: TIA] or [Condition: peripheral vascular disease]